Clinical trial exclusion criterion:
9. Severe hepatic and renal insufficiency (serum creatinine>2.0 mg /dl, AST or ALT is five times higher than the upper limit of normal range);

Entity relations:
- Has_value("serum creatinine", ">2.0 mg /dl")
- Has_value("AST", "five times higher than the upper limit of normal range")
- OR("AST", "ALT")
- OR("serum creatinine", "AST")
- OR("hepatic insufficiency", "renal insufficiency")